Known active cancer receiving treatment

The above is a clinical trial exclusion criterion. Annotated with entity spans:
Known [Qualifier: active] [Condition: cancer] receiving [Procedure: treatment]